Patients who provide written informed consent for the study.

The above is a clinical trial inclusion criterion. Annotated with entity spans:
[Informed_consent: Patients who provide written informed consent for the study.]